have a history of childhood trauma.

The above is a clinical trial inclusion criterion. Annotated with entity spans:
have a [Temporal: history] of [Condition: childhood trauma].